下列有關 2003 年曾發生的嚴重急性呼吸道症候群（Severe acute respiratory syndrome, SARS）之敘述，何者錯誤？
A. 預防傳染該疾病應養成良好衛生習慣，尤其是勤洗手及咳嗽要掩口鼻
B. 流行期避免到人群聚集的地方
C. 發燒時期，感染力高
D. 已有特效藥物，根除此疾病

正確答案：D. 已有特效藥物，根除此疾病